Clinical trial exclusion criterion:
Diabetes mellitus type 1

Annotated entities:
- Condition: "Diabetes mellitus type 1"